Clinical trial exclusion criterion:
5. history of surgery on the Achilles tendon or systemic diseases (general inflammatory diseases such as rheumatologic disorders and diabetes)

Entity relations:
- Has_temporal("surgery on the Achilles tendon", "history")
- Subsumes("general inflammatory diseases", "rheumatologic disorders")
- Subsumes("systemic diseases", "general inflammatory diseases")
- OR("rheumatologic disorders", "diabetes")